Clinical trial exclusion criterion:
3. History or diagnosis of any significant medical conditions: Including but not limited to gastrointestinal, hepatic, renal, respiratory, cardiovascular, metabolic, immunologic, hematological, psychiatric, neurological, oncological or hormonal disorders

Entity relations:
- Subsumes("medical conditions", "gastrointestinal disorders")
- Has_qualifier("medical conditions", "significant")
- OR("gastrointestinal disorders", "metabolic disorders", "hematological disorders", "psychiatric disorders", "hormonal disorders", "oncological disorders", "neurological disorders", "cardiovascular disorders", "respiratory disorders", "renal disorders", "hepatic disorders", "immunologic disorders")